Uremia patients or Creatinine = 2 mg/dl.

The above is a clinical trial exclusion criterion. Annotated with entity spans:
[Condition: Uremia] patients or [Measurement: Creatinine] [Value: = 2 mg/dl].